Clinical trial exclusion criterion:
Subject has permanent pacemaker or defibrillator implant.

Annotated entities:
- Device: "permanent pacemaker"
- Device: "defibrillator implant"